Inflammatory bowel disease that is uncontrolled or on active treatment (Crohn's disease, ulcerative colitis)

The above is a clinical trial exclusion criterion. Annotated with entity spans:
[Condition: Inflammatory bowel disease] that is [Qualifier: uncontrolled] or on active [Procedure: treatment] ([Condition: Crohn's disease], [Condition: ulcerative colitis])